Luis ha empezado este año sus estudios universitarios. En una semana tendrá su primer examen. Él no quiere estudiar para el examen, así que decide que esta tarde va a ir al cine para tener un día de relax antes del mismo. Esta forma de pensamiento justifica que vaya al cine en vez de estar estudiando. Elija el mecanismo de defensa que utiliza Luis para justificar su comportamiento:
1. Minimización.
2. Racionalización.
3. Negación.
4. Intelectualización.

Respuesta correcta: 2. Racionalización.